Clinical trial inclusion criterion:
Age = 19 and = 70 years;

Annotated entities:
- Person: "Age"
- Value: "= 19 and = 70 years"